Clinical trial exclusion criterion:
Patients with a previous use of IFN anti hepatitis B virus treatment or have NAs drug resistance.

Entity relations:
- Has_qualifier("IFN", "anti hepatitis B virus")
- AND("resistance", "NAs drug")
- OR("IFN", "resistance")